Clinical trial exclusion criterion:
11. Use of colchicine, methotrexate, azathioprine, or systemic steroids in the two months preceding screening

Entity relations:
- Has_index("in the two months preceding screening", "screening")
- Has_temporal("colchicine", "in the two months preceding screening")
- OR("colchicine", "methotrexate", "azathioprine", "systemic steroids")